diagnosis,

The above is a clinical trial exclusion criterion. Annotated with entity spans:
[Condition: diagnosis],